Clinical trial inclusion criteria:
Age between one year and 18 years
Sepsis due to MDR or minimally susceptible gram-negative bacteria
History of MDR gram-negative infection or sepsis due to organisms sensitive to colistin.
Culture result consistent with MDR gram negative for this febrile neutropenic episode.
Patient in sepsis and colistin was administered empirically to increase antibiotic coverage.

Annotated entities:
- Person: "Age"
- Value: "between one year and 18 years"
- Condition: "Sepsis"
- Qualifier: "MDR"
- Condition: "minimally susceptible gram-negative bacteria"
- Qualifier: "MDR"
- Condition: "gram-negative infection"
- Condition: "sepsis"
- Qualifier: "sensitive to colistin"
- Observation: "organisms"
- Qualifier: "MDR"
- Condition: "gram negative"
- Condition: "sepsis"
- Drug: "colistin"
- Procedure: "administered empirically"